Clinical trial exclusion criterion:
The patients are in some special conditions that they can't understand the written informed consent, such as they are demented or hawkish.

Annotated entities:
- Post-eligibility: "The patients are in some special conditions that they can't understand the written informed consent, such as they are demented or hawkish."